Which protein mediates the replacement of H2A by H2A.Z in the yeast Saccharomyces cerevisiae?

The chromatin remodeler SWR1 mediates site-specific incorporation of H2A.Z by a multi-step histone replacement reaction, evicting histone H2A-H2B from the canonical nucleosome and depositing the H2A.Z-H2B dimer